Clinical trial exclusion criterion:
Other clinically relevant heart disease

Annotated entities:
- Condition: "heart disease"